Clinical trial inclusion criterion:
HbA1c < 75 mmol/mol (9.0%)

Annotated entities:
- Measurement: "HbA1c"
- Value: "< 75 mmol/mol"
- Value: "9.0%"